¿Cuál de las siguientes capas debe atravesar el espermatozoide para alcanzar al óvulo durante la fecundación?
1. Zona endometrial.
2. Zona pelúcida.
3. Zona estriada.
4. Zona pegajosa.
5. Zona miometrial.

Respuesta correcta: 2. Zona pelúcida.